For how long do Drosophila embryos use maternal genome mRNA?

Mitoses before interphase 14 run on maternal products, and occur in metasynchronous waves. An exceptional case of  Nos-independent regulation by  Pum has been described-repression of maternal bicoid (bcd) m RNA at the anterior pole of the early embryo, dependent on both  Pum and conserved  Pum binding sites in the 3'- UTR of the m RNA